Post-menopausal women

The above is a clinical trial exclusion criterion. Annotated with entity spans:
[Observation: Post-menopausal] [Person: women]